Clinical trial exclusion criterion:
Person falls = once a week due to the reasons that could not be corrected by the new prosthesis (for ex. problems with vestibular system).

Entity relations:
- Has_multiplier("falls", "once a week")